Clinical trial inclusion criterion:
Yale-Brown Obsessive-Compulsive Scale (Y-BOCS) score of = 16

Entity relations:
- Subsumes("Yale-Brown Obsessive-Compulsive Scale", "Y-BOCS")